Clinical trial inclusion criterion:
Symptomatic anemia (hemoglobin <10 g/dL) as determined by investigator

Entity relations:
- Has_qualifier("anemia", "Symptomatic")
- Has_value("hemoglobin", "<10 g/dL")
- AND("anemia", "hemoglobin")